estrogen-progestin therapy in the 2 months before enrollment,

The above is a clinical trial exclusion criterion. Annotated with entity spans:
[Procedure: estrogen-progestin therapy] [Temporal: in the 2 months before enrollment],